What is Uhl's anomaly?

Uhl's anomaly is an extremely rare cardiac defect characterized by absence of the myocardium of the right ventricle.